Clinical trial exclusion criterion:
Pregnancy, age < 18, nursing, or documented allergy to naloxone

Annotated entities:
- Condition: "Pregnancy"
- Person: "age"
- Value: "< 18"
- Condition: "nursing"
- Condition: "allergy"
- Drug: "naloxone"